Evidence of low ovarian reserve by at least one of the following: AMH = 1,5 ng/mL and/or basal CD 3 FSH = 10 mIU/mL and/or basal CD 3 Estradiol = 60 ng/mL and/or previous egg collection yield = 3 oocytes.

The above is a clinical trial exclusion criterion. Annotated with entity spans:
Evidence of [Condition: low ovarian reserve] by at least one of the following: [Measurement: AMH] [Value: = 1,5 ng/mL] and/or [Measurement: basal CD 3 FSH] [Value: = 10 mIU/mL] and/or [Measurement: basal CD 3 Estradiol] [Value: = 60 ng/mL] and/or previous [Measurement: egg collection yield] [Value: = 3 oocytes].